法洛氏四重症（tetralogy of Fallot）病兒會有收縮期雜音，請問此雜音源自下列何種病理變化？
A. 心房中隔缺損
B. 肺動脈出口狹窄
C. 主動脈跨行
D. 右心室肥厚

正確答案：B. 肺動脈出口狹窄